Clinical trial exclusion criterion:
History of alcohol or drug dependence in the past year

Annotated entities:
- Condition: "drug dependence"
- Condition: "alcohol dependence"
- Temporal: "the past year"